Las proteínas que no se pliegan adecuadamente en el retículo endoplásmico son degradadas en:
1. Complejo de Golgi.
2. Endosomas.
3. Lisosomas.
4. Citosol.
5. Núcleo.

Respuesta correcta: 4. Citosol.